drug-alcoholics addiction ;

The above is a clinical trial exclusion criterion. Annotated with entity spans:
drug-[Condition: alcoholics addiction] ;